Clinical trial exclusion criterion:
paraben allergy

Annotated entities:
- Condition: "allergy"
- Drug: "paraben"